Clinical trial inclusion criteria:
Subjects = 19 or = 75 years of age
Subjects undergoing treatment for type 2 diabetes
Subjects undergoing treatment of statin for hypercholesterolemia
Fasting LDL-C = 250mg/dL at the screening visit
Fasting LDL-C =70mg/dL or = 160mg/dL at the randomization visit
Fasting TG<500mg/dL

Annotated entities:
- Value: "= 19 or = 75 years"
- Person: "age"
- Condition: "type 2 diabetes"
- Procedure: "treatment"
- Procedure: "treatment"
- Condition: "hypercholesterolemia"
- Drug: "statin"
- Measurement: "Fasting LDL-C"
- Value: "= 250mg/dL"
- Temporal: "at the screening visit"
- Measurement: "Fasting LDL-C"
- Value: "=70mg/dL"
- Value: "= 160mg/dL"
- Temporal: "at the randomization visit"
- Temporal: "at the randomization visit"
- Measurement: "Fasting TG"
- Value: "<500mg/dL"